一位 7 歲大男孩有嘔吐、腹瀉及發燒三天。於十分鐘前有突發性癲癇大發作而前來住院。根據家屬描述，病孩患有癲癇，常規服用 valproic acid 有一年。期間均未有發作的情形。此次發作前已有兩天不能進食。下列那一項是最不恰當的措施？
A. 詳細詢問最近服藥情況
B. 抽血檢查電解質、血糖及血中 valproic acid 濃度
C. 出院後改用 carbamazepine 取代 valproic acid 之療效
D. 住院時暫以靜脈給予 phenytoin，以抑制癲癇再發

正確答案：C. 出院後改用 carbamazepine 取代 valproic acid 之療效